Clinical trial exclusion criterion:
Current stimulant treatment

Annotated entities:
- Temporal: "Current"
- Procedure: "stimulant treatment"